In which syndrome is the RPS19 gene most frequently mutated?

Ribosomal protein S19 (RPS19), currently the only gene associated with DBA, is mutated in 25% of DBA patients, but its role in erythropoiesis is unknown.